Clinical trial inclusion criterion:
Spondylolisthesis

Annotated entities:
- Condition: "Spondylolisthesis"